Clinical trial exclusion criterion:
History of MI, angina or congestive heart failure.

Entity relations:
- Has_temporal("MI", "History")
- OR("MI", "angina", "congestive heart failure")